Clinical trial exclusion criterion:
Current pregnancy or lactation.

Annotated entities:
- Condition: "lactation"
- Condition: "pregnancy"
- Temporal: "Current"